Clinical trial inclusion criterion:
Subject has a documented or suspected metal sensitivity.

Entity relations:
- AND("sensitivity", "metal")
- Has_mood("sensitivity", "documented")
- OR("documented", "suspected")